下列關於肺炎鏈球菌（Streptococcus pneumoniae）感染的敘述，何者正確？
A. 肺炎鏈球菌菌血症在嬰兒和老人較一般成人常見
B. 免疫不全的病人（如：脾切除的病人）施打肺炎鏈球菌疫苗是禁忌
C. 肺炎鏈球菌咽喉炎是肺炎鏈球菌腦膜炎最常見的先行事件
D. 血液白血球明顯增高（marked leukocytosis）相對於宿主因素，是預測肺炎鏈球菌感染預後不佳的主要因素

正確答案：A. 肺炎鏈球菌菌血症在嬰兒和老人較一般成人常見